Clinical trial exclusion criterion:
Abnormal renal function

Annotated entities:
- Value: "Abnormal"
- Measurement: "renal function"
- Condition: "Abnormal renal function"